El efecto prozona de un análisis turbidimétrico puede detectarse midiendo la absorbancia:
1. Después de una ultracentrifugación.
2. Previa concentración de la muestra.
3. Previa dilución de la muestra.
4. Una vez tratada la muestra con SDS.
5. Dos veces consecutivas.

Respuesta correcta: 3. Previa dilución de la muestra.